一位 42 歲男性因嘔吐來急診，醫師檢查嘔吐物時發現內含膽汁，則最可能是下列那種疾病？
A. 十二指腸末端腫瘤阻塞
B. 胃幽門阻塞
C. 食道腫瘤阻塞
D. 食道弛緩不能症

正確答案：A. 十二指腸末端腫瘤阻塞